Clinical trial inclusion criterion:
choroidal neovascularization caused by age-related macula degeneration

Annotated entities:
- Condition: "choroidal neovascularization"
- Qualifier: "age-related"
- Condition: "macula degeneration"